Clinical trial exclusion criterion:
Subjects with serum calcium levels equal to or greater than 10.2 mg / dl.

Entity relations:
- Has_value("serum calcium levels", "equal to or greater than 10.2 mg / dl")